Clinical trial inclusion criterion:
Patients give informed consent prior to participating in this study.

Annotated entities:
- Informed_consent: "Patients give informed consent prior to participating in this study"